Clinical trial inclusion criterion:
Participants must be willing to comply with all study related procedures

Annotated entities:
- Post-eligibility: "Participants must be willing to comply with all study related procedures"